下面的傳染病中，何者是臺灣傳染病通報分級中的第一類（必須立即通報）？
A. 狂犬病
B. 日本腦炎
C. 瘧疾
D. 梅毒

正確答案：A. 狂犬病